What is the usual HER-2 status in breast cancer associated with Li-Fraumeni syndrome?

In up to two thirds of breast cancer patients associated with Li-Fraumeni syndrome, the HER-2 status was found to be positive.